Clinical trial exclusion criterion:
Gastrointestinal ulcer or tumor

Annotated entities:
- Condition: "Gastrointestinal ulcer"
- Condition: "Gastrointestinal tumor"